En el ser humano, Lactobacillus acidophilus forma parte de la microbiota normal de :
1. El tracto genital femenino.
2. La buco-faringe.
3. El tracto urinario.
4. La piel.
5. El tracto respiratorio.

Respuesta correcta: 1. El tracto genital femenino.